Clinical trial exclusion criterion:
Significant pulmonary disease, (e.g., restrictive pulmonary disease, constrictive or chronic obstructive pulmonary disease) or any other disease or malfunction of the lungs or respiratory system that produces chronic symptoms.

Entity relations:
- Has_qualifier("pulmonary disease", "Significant")
- Subsumes("pulmonary disease", "restrictive pulmonary disease")
- Has_qualifier("disease of the lungs", "any other")
- AND("disease of the lungs", "chronic symptoms")
- OR("restrictive pulmonary disease", "constrictive pulmonary disease", "chronic obstructive pulmonary disease")
- OR("disease of the lungs", "malfunction of the lungs", "disease of the respiratory system")
- OR("pulmonary disease", "disease of the lungs")